Patients with histologically confirmed diagnosis of prostate cancer who have not yet developed bone metastases

The above is a clinical trial inclusion criterion. Annotated with entity spans:
Patients with [Measurement: histologically] [Value: confirmed] diagnosis of [Condition: prostate cancer] who have not yet developed [Condition: bone metastases]